History of recurrent UTI (defined as three culture proven UTIs within last 12 months)

The above is a clinical trial exclusion criterion. Annotated with entity spans:
History of [Condition: recurrent UTI] (defined as [Multiplier: three] [Measurement: culture] proven UTIs [Temporal: within last 12 months])